唑（Azole）類抗黴菌劑的作用機轉是：
A. 抑制蛋白質合成
B. 抑制細胞膜生成
C. 抑制核酸合成
D. 抑制細胞壁生成

正確答案：B. 抑制細胞膜生成